Chemotherapy or radiation within 3 weeks of the first scheduled study treatment.

The above is a clinical trial exclusion criterion. Annotated with entity spans:
[Drug: Chemotherapy] or [Procedure: radiation] [Temporal: within 3 weeks of the first scheduled study treatment].